Clinical trial exclusion criterion:
preoperative use of either pregabalin, gabapentin or strong opiates

Entity relations:
- Has_temporal("pregabalin", "preoperative")
- OR("pregabalin", "gabapentin", "strong opiates")